Subject has renal dysfunction with glomerular filtration rate < 60 ml / min.

The above is a clinical trial exclusion criterion. Annotated with entity spans:
Subject has [Condition: renal dysfunction] with [Measurement: glomerular filtration rate] [Value: < 60 ml / min].